Bloodpressure 150/95 or higher.

The above is a clinical trial exclusion criterion. Annotated with entity spans:
[Measurement: Bloodpressure] [Value: 150/95 or higher].